are allergic to influenza vaccination

The above is a clinical trial exclusion criterion. Annotated with entity spans:
are [Condition: allergic] to [Drug: influenza vaccination]